Clinical trial inclusion criterion:
1. Menstruating females 10-19 years of age

Entity relations:
- Has_value("age", "10-19 years")